Ovarian, endometrial or cervical - Gynecologic Oncology Group (GOG) performance score ≤2

The above is a clinical trial inclusion criterion. Annotated with entity spans:
[Qualifier: Ovarian], [Qualifier: endometrial] or [Qualifier: cervical] - [Measurement: Gynecologic Oncology Group (GOG) performance score] [Value: ≤2]